Any major psychiatric disorder, such as severe depression, severe anxiety disorder, psychosis, schizophrenia, other major psychiatric disorders, or seizures. History of mild depression or anxiety disorder that are well controlled are not exclusion criteria.

The above is a clinical trial exclusion criterion. Annotated with entity spans:
Any [Condition: major psychiatric disorder], such as [Qualifier: severe] [Condition: depression], [Qualifier: severe] [Condition: anxiety disorder], [Condition: psychosis], [Condition: schizophrenia], [Qualifier: other] [Condition: major psychiatric disorders], or [Condition: seizures]. History of [Qualifier: mild] [Condition: depression] or [Condition: anxiety disorder] that are [Qualifier: well controlled] are [Negation: not] exclusion criteria.